婦產科急診有一位 17 歲女生，因月經過期，呈點狀出血，左下腹疼痛，主訴無性經驗，則何種檢查為第一優先？
A. 驗孕試驗
B. 陰道超音波
C. 腹部電腦斷層檢查
D. 抹片檢查

正確答案：A. 驗孕試驗